coagulopathies including platelet count of less than 100,000

The above is a clinical trial exclusion criterion. Annotated with entity spans:
[Condition: coagulopathies] including [Measurement: platelet count] of [Value: less than 100,000]